Clinical trial exclusion criterion:
Patients who had received surgical periodontal treatment within the past 12 months

Entity relations:
- Has_temporal("surgical periodontal treatment", "within the past 12 months")